Clinical trial exclusion criterion:
allergy to constituents in Xenbilox (capsules with chenodeoxycholic acid)

Annotated entities:
- Condition: "allergy"
- Drug: "constituents in Xenbilox"
- Drug: "chenodeoxycholic acid"